Clinical trial exclusion criterion:
AST(aspartate aminotransferase)/ALT(alanine aminotransaminase) >2.5 upper limit of normal

Entity relations:
- Subsumes("AST", "aspartate aminotransferase")
- Subsumes("ALT", "alanine aminotransaminase")
- Has_value("AST", ">2.5 upper limit of normal")
- Has_value("ALT", ">2.5 upper limit of normal")